評估醫療品質，常用 Donabedian 所提出的三個構面來檢視，其中，以臨床路徑（clinical pathway）來改善醫療品質，是屬於那一個構面？
A. 背景
B. 結構
C. 過程
D. 結果

正確答案：C. 過程